Clinical trial inclusion criterion:
1. Menstruating females 10-19 years of age

Annotated entities:
- Condition: "Menstruating"
- Person: "females"
- Value: "10-19 years"
- Person: "age"